La prueba de Mantoux (reacción a la tuberculina) es:
1. Una reacción de hipersensibilidad retardada.
2. Una reacción de hipersensibilidad inmediata.
3. Una reacción de hipersensibilidad por inmunocomplejos.
4. Una reacción de inflamación no específica.
5. Una manifestación de autoinmunidad.

Respuesta correcta: 1. Una reacción de hipersensibilidad retardada.